一位 30 歲之婦女懷孕 35 週時因高血壓住院控制血壓，其血壓為 190/120 mmHg，有明顯蛋白尿（2.5 g/24 hour），她同時有頭痛及視力模糊之情況，胎心音監視器顯示胎心跳變異性較低，但是速度正常，子宮每 7～8 分鐘收縮一次，子宮收縮時並無胎心跳變慢之情況，超音波預估胎兒體重為 2150 公克。最合理之處理方式為：
A. 安胎，進一步評估胎兒健康狀況
B. 控制血壓並終止懷孕
C. 補充高蛋白營養
D. 進一步評估胎盤功能並供應孕婦氧氣

正確答案：B. 控制血壓並終止懷孕